Clinical trial exclusion criteria:
Inability to obtain consent
Subjects under 18 years of age
Non-English speaking subjects
Subjects that are unable to lay flat due to pulmonary complications, increased intracranial pressure (ICP), or unstable spinal cord injuries
Subjects with known cardiac abnormalities (atrial septal defects or ventricular septal defects, severe tricuspid valve disease, severe pulmonary hypertension, Ejection fraction < 15%)
Prisoners
Subjects with known upper extremity deep vein thromboses (subclavian or distal)
Subjects with non-functional CICC or PICC distal ports
Subjects with femoral CICCs
Pregnant women

Annotated entities:
- Post-eligibility: "Inability to obtain consent"
- Value: "under 18 years"
- Person: "age"
- Non-query-able: "Non-English speaking subjects"
- Condition: "unable to lay flat"
- Condition: "pulmonary complications"
- Qualifier: "due to pulmonary complications"
- Condition: "increased intracranial pressure (ICP)"
- Condition: "spinal cord injuries"
- Qualifier: "unstable"
- Condition: "cardiac abnormalities"
- Condition: "atrial septal defects"
- Condition: "ventricular septal defects"
- Condition: "tricuspid valve disease"
- Qualifier: "severe"
- Condition: "pulmonary hypertension"
- Qualifier: "severe"
- Measurement: "Ejection fraction"
- Value: "< 15%"
- Person: "Prisoners"
- Non-query-able: "Prisoners"
- Condition: "upper extremity deep vein thromboses"
- Qualifier: "subclavian"
- Qualifier: "distal"
- Device: "CICC distal ports"
- Device: "PICC distal ports"
- Qualifier: "non-functional"
- Device: "femoral CICCs"
- Person: "women"
- Condition: "Pregnant"